Serum or plasma aminotransferases (AST, ALT) less than 3 times the upper limit of normal

The above is a clinical trial inclusion criterion. Annotated with entity spans:
[Measurement: Serum] or [Measurement: plasma aminotransferases] ([Measurement: AST], [Measurement: ALT]) [Value: less than 3 times the upper limit of normal]